Después de un parto vaginal normal de baja intervención, en una mujer sana con un recién nacido sano, ¿cuál es el mejor momento para iniciar la lactancia materna?
1. Después del nacimiento, pues es el momento de reconocimiento madre-hijo.
2. Después de los primeros cuidados inmediatos del recién nacido de higiene, identificación y prevención, si este está estable.
3. Después del alumbramiento y de la finalización de los cuidados de parto, pues antes la mujer no está en condiciones de atender a su hijo.
4. Después de las primeras dos hojas del parto que requieren extrema vigilancia de la mujer por el riesgo de hemorragia postparto.
5. Después de llegar a planta, pues coincide con el segundo periodo de reactividad del bebé y las mejores condiciones de la mujer para poder interaccionar con su hijo.

Respuesta correcta: 1. Después del nacimiento, pues es el momento de reconocimiento madre-hijo.